關於 Legionnaire's disease 的敘述，下列何者錯誤？
A. 目前有超過 50 種的 Legionella species 被確認，其中 Legionella pneumophila serogroup 1 是最常見的致病原
B. Legionella species 是 small, Gram(-) bacilli
C. Urine antigen detection 對於 Legionella pneumophila serogroup 1 感染的診斷，Specificity 很高＞99%，但是 sensitivity 很低＜50%
D. 對於mild到moderate severity的病患，治療的首選藥物為Erythromycin或Doxycycline或Azithromycin

正確答案：C. Urine antigen detection 對於 Legionella pneumophila serogroup 1 感染的診斷，Specificity 很高＞99%，但是 sensitivity 很低＜50%